Clinical trial exclusion criterion:
Acute illness or infection;

Annotated entities:
- Condition: "infection"
- Condition: "illness"
- Qualifier: "Acute"